Clinical trial exclusion criterion:
History of ischemic cerebrovascular disorders (e.g., stroke, transient ischemic attack) or ischemia of the spinal cord

Annotated entities:
- Condition: "ischemic cerebrovascular disorders"
- Condition: "stroke"
- Condition: "transient ischemic attack"
- Condition: "ischemia of the spinal cord"